Clinical trial inclusion criterion:
PLT = 80 × 109 / L

Entity relations:
- Has_value("PLT", "= 80 × 109 / L")